Clinical trial exclusion criterion:
Subjects prescribed metformin or have taken metformin within 1 year.

Annotated entities:
- Drug: "metformin"
- Drug: "metformin"
- Temporal: "within 1 year"